Age: 18-45 years old

The above is a clinical trial inclusion criterion. Annotated with entity spans:
[Person: Age]: [Value: 18-45 years old]